一位 50 歲病人，腎超音波檢查可見兩個腎臟皆長約 15 公分，以及非常多個大小不一的囊泡（cysts），家族中亦有人患有此病，下列敘述何者錯誤？
A. 大多數的病人為自體隱性（autosomal recessive）遺傳
B. 病人產生腎結石的機會較一般人高
C. 有些病人會出現顱內血管瘤（aneurysm），但不需所有此類病人皆作顱內血管瘤的篩檢
D. 若囊泡出現細菌感染，ciprofloxacin 是用藥選擇之一

正確答案：A. 大多數的病人為自體隱性（autosomal recessive）遺傳